Patient who is HCV negative has received an HCV positive (HCV RNA by PCR or HCV antibody) donor liver

The above is a clinical trial exclusion criterion. Annotated with entity spans:
Patient who is [Measurement: HCV] [Value: negative] has received an [Measurement: HCV] [Value: positive] ([Measurement: HCV RNA] by [Measurement: PCR] or [Measurement: HCV antibody]) [Person: donor] [Qualifier: liver]